Clinical trial exclusion criterion:
Evidence or history of Cor Pulmonale

Entity relations:
- Has_mood("Cor Pulmonale", "Evidence")
- OR("Evidence", "history")